Clinical trial exclusion criterion:
No contraception.

Entity relations:
- Has_negation("contraception", "No")